What cellular process is the protein clathrin involved in?

Receptor-mediated endocytosis proceeds by transfer of receptor-ligand complexes from clathrin-coated pits at the cell surface to uncoated endocytic vesicles termed receptosomes (or endosomes). while clathrin mediated endocytosis w